下列何種疾病在血液檢查中出現 SS-A/Ro 自體抗體（SS-A/Ro autoantibody）的機會最高？
A. 全身性紅班性狼瘡（systemic lupus erythematosus）
B. 亞急性皮膚型紅斑性狼瘡（subacute cutaneous lupus erythematosus）
C. 盤狀紅斑性狼瘡（discoid lupus erythematosus）
D. 硬皮症（scleroderma）

正確答案：B. 亞急性皮膚型紅斑性狼瘡（subacute cutaneous lupus erythematosus）